In France, a subject is neither affiliated with nor a beneficiary of a social security category.

The above is a clinical trial exclusion criterion. Annotated with entity spans:
[Non-representable: In France, a subject is neither affiliated with nor a beneficiary of a social security category.]